Patients with cardiac disease or using anti-arrhythmic agents

The above is a clinical trial exclusion criterion. Annotated with entity spans:
Patients with [Condition: cardiac disease] or using [Drug: anti-arrhythmic agents]